Clinical trial exclusion criterion:
Current HAART use for HIV, long term use of immunosuppressants (e.g. steroids, chemotherapy, TNF-inhibitors and related agents)

Entity relations:
- AND("HAART", "HIV")
- Has_multiplier("immunosuppressants", "long term use")
- Subsumes("immunosuppressants", "steroids")
- OR("steroids", "chemotherapy", "TNF-inhibitors")
- OR("HAART", "immunosuppressants")